Clinical trial exclusion criterion:
antipsychotics or other dopamine antagonists

Annotated entities:
- Drug: "antipsychotics"
- Drug: "dopamine antagonists"